Clinical trial exclusion criterion:
proliferative retinopathy or autonomic neuropathy;

Entity relations:
- OR("proliferative retinopathy", "autonomic neuropathy")